4) residual paresis in the lower extremity (Fugl-Meyer LE motor score <34),

The above is a clinical trial inclusion criterion. Annotated with entity spans:
[Parsing_Error: 4)] [Condition: residual paresis] in the [Qualifier: lower extremity] ([Measurement: Fugl-Meyer LE motor score] [Value: <34]),